Clinical trial exclusion criterion:
Primary indication for ACE inhibitor use, i.e. Congestive Heart Failure, CAD, diabetes

Entity relations:
- Subsumes("Primary indication for ACE inhibitor use", "Congestive Heart Failure")
- OR("Congestive Heart Failure", "CAD", "diabetes")